En el postoperatorio, signos clínicos como temperatura elevada, tos, expectoración, disnea y dolor torácico, corresponden a un paciente que presenta:
1. Embolia pulmonar.
2. Enfisema pulmonar.
3. Neumonía.
4. Atelectasia.
5. Crisis asmática.

Respuesta correcta: 3. Neumonía.